Male, or female, 19 years to 75 years.

The above is a clinical trial inclusion criterion. Annotated with entity spans:
[Person: Male], or [Person: female], [Value: 19 years to 75] [Person: years].